Which deficiency is the cause of restless leg syndrome?

It has been well-documented that iron deficiency is the cause of restless leg syndrome. Magnesium and ferritin were also associated with restless leg syndrome.